Clinical trial exclusion criterion:
Patients with heat intolerance

Annotated entities:
- Condition: "heat intolerance"